Clinical trial exclusion criterion:
Inability to use verbal or pictorial pain scoring scales

Entity relations:
- AND("Inability", "verbal pain scoring scales")
- OR("verbal pain scoring scales", "pictorial pain scoring scales")